外傷患者發現左小腿有骨折且持續腫脹，下列臨床判斷何者錯誤？
A. 有可能發生腔室症候群（compartment syndrome）
B. 腔室症候群的典型症狀包括疼痛、腫脹、麻痺及感覺異常等
C. 疼痛腫脹是最早出現的症狀
D. 肢體遠端摸到脈搏時，表示腔室症候群還沒產生

正確答案：D. 肢體遠端摸到脈搏時，表示腔室症候群還沒產生